Una pareja sana tiene una hija de 8 años con hepatoesplenomegalia. El laboratorio de genética bioquímica ha detectado en ella un déficit de la enzima beta-glucosidasa ácida (glucocerebrosidasa) y molecularmente presenta la mutación N370S en homocigosis. ¿Qué diagnóstico es el correcto?
1. Enfermedad de Fabry (Xq22.1).
2. Enfermedad de Huntington (4p16.3).
3. Ataxia cerebelosa autosómica dominante SCA1 (6p22.3).
4. Adrenoleucodistrofia (Xq28).
5. Enfermedad de Gaucher (1q22).

Respuesta correcta: 5. Enfermedad de Gaucher (1q22).